Women undergoing cesarean section with general anesthesia will be excluded, because carbetocin is licensed for use with regional anaesthesia only.

The above is a clinical trial exclusion criterion. Annotated with entity spans:
[Person: Women] undergoing [Procedure: cesarean section] with [Qualifier: general anesthesia] will be excluded, [Non-representable: because carbetocin is licensed for use with regional anaesthesia only].